Clinical trial exclusion criterion:
Active alcohol or drug use or dependence which may interfere with adherence to study requirements

Annotated entities:
- Intoxication_considerations: "Active alcohol or drug use or dependence which may interfere with adherence to study requirements"